有關乳癌的治療，下列何者錯誤？
A. 腋下淋巴有無癌轉移是乳癌最重要的預後指標之一
B. 乳癌estrogen receptor存在（陽性），應給抗荷爾蒙治療
C. 乳癌病人術後均應給予化學治療，避免復發
D. 第一期和第二期乳癌，若無多發性病灶，保留乳房與切除乳房的存活率兩者相當

正確答案：C. 乳癌病人術後均應給予化學治療，避免復發